Clinical trial exclusion criteria:
Not applicable to this follow up study

Annotated entities:
- Non-representable: "Not applicable to this follow up study"